Clinical trial exclusion criterion:
Any history of pancreatic injury, pancreatitis or evidence of impaired pancreatic function/injury as indicated by abnormal lipase or amylase Evidence of hepatic disease, a history of hepatic encephalopathy, a history of esophageal varices, or a history of portocaval shunt

Annotated entities:
- Condition: "pancreatic injury"
- Temporal: "history"
- Condition: "pancreatitis"
- Measurement: "pancreatic function"
- Value: "impaired"
- Condition: "pancreatic injury"
- Measurement: "lipase"
- Value: "abnormal"
- Measurement: "amylase"
- Condition: "hepatic disease"
- Temporal: "history"
- Condition: "hepatic encephalopathy"
- Condition: "esophageal varices"
- Condition: "portocaval shunt"
- Temporal: "history"
- Temporal: "history"